¿Cuál de los siguientes compuestos que incrementan la absorción nasal de fármacos actúa incrementando el tiempo de permanencia en la mucosa nasal?:
1. Glicolato sódico.
2. Metilcelulosa.
3. EDTA.
4. Histamina.

Respuesta correcta: 2. Metilcelulosa.